Clinical trial exclusion criterion:
Abnormal resting ECG

Annotated entities:
- Value: "Abnormal"
- Procedure: "resting ECG"